Clinical trial inclusion criterion:
Understands and signs the informed consent form.

Annotated entities:
- Informed_consent: "Understands and signs the informed consent form."